Normal organ function within 14 days of study entry

The above is a clinical trial inclusion criterion. Annotated with entity spans:
[Condition: Normal organ function] [Temporal: within 14 days of study entry]